有關女性之敘述，下列何者最不正確？
A. 在停經後許多疾病之發生率會增加
B. 造成女性死亡最常見的疾病包括惡性腫瘤、心血管疾病及腦血管疾病
C. 成年婦女最擔心得到乳癌
D. 年紀大於 85 歲的女性最可能死於乳癌

正確答案：D. 年紀大於 85 歲的女性最可能死於乳癌